Clinical trial inclusion criterion:
Non-ventilated Patients over the age of 65

Entity relations:
- Has_value("age", "over 65")
- Has_negation("ventilated", "Non")